Clinical trial inclusion criterion:
Meets DSM-V criteria for current Alcohol Use Disorder

Annotated entities:
- Measurement: "DSM-V criteria"
- Value: "Meets"
- Condition: "Alcohol Use Disorder"